某一國家人口 6000 萬人，該年新發肺結核病患 5000 人，肺結核病患共 2 萬人，當年死亡人數為 60 萬人，其中因為肺結核死亡者有 500 人。該年肺結核死因分率是多少？
A. 500/2 萬
B. 500/60 萬
C. 500/6000 萬
D. 500/5000

正確答案：B. 500/60 萬